Clinical trial exclusion criterion:
Patients with chronic pain requiring treatment, with a known allergy to paracetamol, or concomitant use of non-steroidal anti-inflammatories , oral anticoagulants or corticosteroids.

Annotated entities:
- Condition: "chronic pain"
- Qualifier: "requiring treatment"
- Condition: "known allergy"
- Drug: "paracetamol"
- Drug: "non-steroidal anti-inflammatories"
- Temporal: "concomitant"
- Drug: "oral anticoagulants"
- Drug: "corticosteroids"